Clinical trial exclusion criterion:
8. Allergy or hypersensitivity to metformin hydrochloride. 9. History of difficulty in swallowing medication, or any gastrointestinal disorder which could affect the drug absorption.

Entity relations:
- AND("hypersensitivity", "metformin hydrochloride")
- AND("Allergy", "metformin hydrochloride")
- Has_temporal("difficulty in swallowing medication", "History")
- Has_qualifier("gastrointestinal disorder", "affect the drug absorption")
- OR("Allergy", "hypersensitivity")
- OR("difficulty in swallowing medication", "gastrointestinal disorder")